What is predicted using SURFY?

surfaceome predictor SURFY, based on machine learning.